Clinical trial inclusion criterion:
Anti-mullerian hormone (AMH) greater than (>) 1.1 nanogram per milliliter (ng/mL)

Entity relations:
- Has_value("Anti-mullerian hormone (AMH)", "greater than (>) 1.1 nanogram per milliliter (ng/mL)")